Total bilirubin ≤ 1.5 X the upper limit of normal (ULN) unless a known history of impaired bilirubin conjugation such as Gilbert's, for whom the maximum will be 2.5 ULN.

The above is a clinical trial inclusion criterion. Annotated with entity spans:
[Measurement: Total bilirubin] [Value: ≤ 1.5 X the upper limit of normal (ULN)] unless a known history of [Condition: impaired bilirubin conjugation] such as [Condition: Gilbert's], for whom the [Value: maximum] will be 2.5 ULN.